Clinical trial inclusion criterion:
Second trimester pregnancy.

Annotated entities:
- Qualifier: "Second trimester"
- Condition: "pregnancy"
- Temporal: "Second trimester"